Beta-lactam allergy

The above is a clinical trial exclusion criterion. Annotated with entity spans:
[Drug: Beta-lactam] [Condition: allergy]